La hipotermia no intencionada del paciente durante el acto anestésico puede dar lugar a una serie de alteraciones que son perjudiciales para el paciente. ¿Cuándo consideramos que la hipotermia es moderada?
1. Temperatura corporal < 20º C.
2. Temperatura corporal de 26º C a 20º C.
3. Temperatura corporal de 32º C a 26º C.
4. Temperatura de 37º C a 32º C.

Respuesta correcta: 3. Temperatura corporal de 32º C a 26º C.